男子燒炭自殺被人發現送醫，急救後仍然維持昏迷狀態。他腦部的病理變化大部分是因何而起？
A. 一氧化碳與血紅素結合的親和力比氧氣高很多
B. 流往腦部的血液減少
C. 腦部的神經膠細胞是全身最易被缺氧傷害的細胞
D. 一氧化碳的組織毒性

正確答案：A. 一氧化碳與血紅素結合的親和力比氧氣高很多